Uterine anomalies.

The above is a clinical trial exclusion criterion. Annotated with entity spans:
[Condition: Uterine anomalies].